What is Aortitis?

Aortitis is an inflammation of the aorta due to various causes. It can be a symptom of an underlying infectious or non-infectious disease process.